Which cells produce Interleukin 17A?

Interleukin (IL)-17A is secreted from T helper type 17 (TH17) cells.